Clinical trial exclusion criterion:
AUDIT score of < 5 or > 26

Annotated entities:
- Measurement: "AUDIT"
- Value: "score of < 5 or > 26"